老年人常伴有退化性頸椎關節炎，發生頸部過度後仰（hyperextension）受傷時，最易發生下列何種脊髓損傷？
A. 中心脊髓症候群（central cord syndrome）
B. 前脊髓症候群（anterior cord syndrome）
C. 錐狀脊髓症候群（conus medullaris syndrome）
D. 布朗西夸氏（Brown-Sequard）症候群

正確答案：A. 中心脊髓症候群（central cord syndrome）